Life expectancy less than 2 years

The above is a clinical trial exclusion criterion. Annotated with entity spans:
[Observation: Life expectancy] [Value: less than 2 years]